MMSE (Mini Mental State Examination)score > or = 15

The above is a clinical trial inclusion criterion. Annotated with entity spans:
[Measurement: MMSE (Mini Mental State Examination)][Value: score > or = 15]